評估陰道自然生產是否能夠成功，最適當的方法為何？
A. 骨盆腔 X 光攝影測量母親骨盆腔的大小
B. 超音波檢查估計胎兒的體重
C. 母親的身高
D. 產程進展的評估包括子宮頸的擴張和胎頭的下降

正確答案：D. 產程進展的評估包括子宮頸的擴張和胎頭的下降